Sever liver impairment (liver failure)

The above is a clinical trial exclusion criterion. Annotated with entity spans:
[Qualifier: Sever] [Condition: liver impairment] ([Condition: liver failure])